Clinical trial exclusion criterion:
13. Body mass index ≥35.0 at Screening.

Entity relations:
- Has_value("Body mass index", "≥35.0")
- Has_index("at Screening", "Screening")
- Has_temporal("Body mass index", "at Screening")